Clinical trial inclusion criterion:
AST and ALT = 80U/L

Annotated entities:
- Measurement: "AST"
- Measurement: "ALT"
- Value: "= 80U/L"